Consumption or injection of insulin

The above is a clinical trial exclusion criterion. Annotated with entity spans:
Consumption or [Procedure: injection] of [Drug: insulin]